Clinical trial exclusion criterion:
Significant anemia or polycythemia defined as hemoglobin >18gm/dL or hemoglobin <7gm/dL

Entity relations:
- Has_value("hemoglobin", "<7gm/dL")
- Has_value("hemoglobin", ">18gm/dL")
- Subsumes("anemia", "hemoglobin")
- Has_qualifier("anemia", "Significant")
- OR("hemoglobin", "hemoglobin")
- OR("anemia", "polycythemia")